雪人形心臟（Snowman heart）最常見於：
A. 全肺靜脈回流異常（Total anomalous pulmonary venous return）
B. 部份肺靜脈回流異常（Partial anomalous pulmonary venous return）
C. 大血管轉位症（Transposition of great arteries）
D. 法洛式四重畸型（Tetralogy of Fallot）

正確答案：A. 全肺靜脈回流異常（Total anomalous pulmonary venous return）